Clinical trial inclusion criterion:
Non-invasive tear film break-up time (NITBUT) <10 s in at least one eye

Entity relations:
- Has_value("Non-invasive tear film break-up time (NITBUT)", "<10 s")
- Has_multiplier("eye", "at least one")
- Has_qualifier("Non-invasive tear film break-up time (NITBUT)", "eye")